25歲張先生第2次躁症發作，有明顯睡眠減少、誇大妄想及宗教妄想。第1次躁症發作是在2年前，過去沒有憂鬱症病史，這次用鋰鹽（lithium）及冬眠靈（chlorpromazine）治療，鋰鹽濃度達 2 mEq/L，治療3個月後，思想與情緒恢復正常。當病情穩定後，下列藥物處理何者最適當？
A. 直接停用鋰鹽，以免造成腎功能障礙
B. 只要停用冬眠靈，以免發生遲發性運動異常（tardive dyskinesia）
C. 同時停用鋰鹽及冬眠靈
D. 稍微降低鋰鹽劑量，並停用冬眠靈

正確答案：D. 稍微降低鋰鹽劑量，並停用冬眠靈